What is the function of PARP1?

parp1 plays key roles in dna repair, as well as a wide variety of cellular processes, including transcriptional regulation